一位 30 歲男性，肝炎標記檢查顯示 HBsAg（－）、Anti-HBs（+）及 IgG Anti-HBc（－），下列何者為最適當的診斷？
A. 急性 B 型肝炎
B. 慢性 B 型肝炎合併急性發作
C. 低濃度 B 型肝炎表面抗原（HBsAg）的帶原者
D. Anti-HBs為假陽性或曾接受B型肝炎疫苗注射

正確答案：D. Anti-HBs為假陽性或曾接受B型肝炎疫苗注射